Clinical trial exclusion criterion:
Abnormal hepatic function (liver function test > twice the normal range), abnormal renal function (creatinine > 1.1 mg/dl), fasting plasma glucose in the diabetic range (>/= 126 mg/dl), or blood pressure > 140/90 mmHg.

Annotated entities:
- Measurement: "hepatic function"
- Value: "Abnormal"
- Measurement: "liver function test"
- Value: "> twice the normal range"
- Measurement: "renal function"
- Value: "abnormal"
- Measurement: "creatinine"
- Value: "> 1.1 mg/dl"
- Measurement: "fasting plasma glucose"
- Value: "in the diabetic range"
- Value: ">/= 126 mg/dl"
- Measurement: "blood pressure"
- Value: "> 140/90 mmHg"